Clinical trial exclusion criterion:
Current use of mixed agonist/antagonist (such as pentazocine, nalbuphine or butorphanol) and partial agonist (buprenorphine) analgesics

Entity relations:
- OR("pentazocine", "nalbuphine", "butorphanol", "buprenorphine")